Clinical trial inclusion criteria:
Newly diagnosed glioblastoma (GBM), WHO grade IV.

Annotated entities:
- Condition: "glioblastoma"
- Condition: "GBM"
- Measurement: "WHO"
- Value: "grade IV"
- Qualifier: "Newly diagnosed"